La inclusión lipídica de los adipocitos uniloculares está rodeada por:
1. Filamentos de actina.
2. Filamentos de miosina.
3. Filamentos de vimentina.
4. Microtúbulos.
5. Membrana proveniente del retículo endoplasmático liso.

Respuesta correcta: 3. Filamentos de vimentina.